Clinical trial exclusion criterion:
Heart failure requiring loop diuretics

Entity relations:
- AND("Heart failure", "loop diuretics")